Underlying Rheumatoid arthritis, stroke, malignancy, venous occlusion

The above is a clinical trial exclusion criterion. Annotated with entity spans:
[Qualifier: Underlying] [Condition: Rheumatoid arthritis], [Condition: stroke], [Condition: malignancy], [Condition: venous occlusion]